Clinical trial inclusion criterion:
3. Steroids less than 0.5 mg/kg/day prednisone

Entity relations:
- Subsumes("Steroids", "prednisone")
- Has_multiplier("prednisone", "less than 0.5 mg/kg/day")